cannot communicate.

The above is a clinical trial exclusion criterion. Annotated with entity spans:
[Observation: cannot communicate].